40歲男性，自2個月前開始有漸進性的右側耳鳴，此耳鳴與脈搏頻率相近，夜間會較大聲且影響其睡眠，並有 右側耳後枕部頭痛。最可能的診斷為何？
A. 腦內動靜脈畸形（arteriovenous malformation）
B. 硬腦膜靜脈竇栓塞（dural sinus thrombosis）
C. 硬腦膜動靜脈瘻管（dural arteriovenous fistula）
D. 腦動脈瘤（cerebral aneurysm）

正確答案：C. 硬腦膜動靜脈瘻管（dural arteriovenous fistula）